ASA classification II or III females

The above is a clinical trial inclusion criterion. Annotated with entity spans:
[Measurement: ASA classification] [Value: II or III] [Person: females]